Patients with any active infection including HBV, HCV and HIV.

The above is a clinical trial exclusion criterion. Annotated with entity spans:
Patients with any [Condition: active infection] including [Condition: HBV], [Condition: HCV] and [Condition: HIV].